Clinical trial exclusion criterion:
10. Within 30 days prior to the index study procedure, the subject has undergone a previous coronary interventional procedure of any kind. Note: This exclusion criterion does not apply to post-STEMI patients.

Entity relations:
- Has_temporal("coronary interventional procedure", "previous")
- multi("Within 30 days prior to the index study procedure", "the index study procedure")
- Has_temporal("coronary interventional procedure", "Within 30 days prior to the index study procedure")
- Has_negation("STEMI", "not")